出生於溫哥華之加拿大籍華裔青年大衛，今年暑假第一次回臺灣探望高齡祖父母，搭機前接受過 2 次 B 型肝炎疫苗注射，他血清中對 B 型肝炎表面抗原的抗體最有可能的情形為何？
A. 第一次疫苗接種後第 5 天出現極高量 IgM
B. 第一次疫苗接種後第 5 天出現極高量 IgG
C. 第二次疫苗接種後第 5 天出現極高量 IgM
D. 第二次疫苗接種後第 5 天出現極高量 IgG

正確答案：D. 第二次疫苗接種後第 5 天出現極高量 IgG